Clinical trial exclusion criterion:
4. Subjects with history or evidence upon physical examination of CNS disease, including primary brain tumor, seizures not controlled with standard medical therapy, any brain metastases, or, within six months prior to Day 1 of this study, history of cerebrovascular accident (CVA, stroke), transient ischemic attack (TIA) or subarachnoid hemorrhage.

Entity relations:
- AND("controlled", "standard medical therapy")
- Has_negation("controlled", "not")
- Has_qualifier("seizures", "controlled")
- Has_index("within six months prior to Day 1 of this study", "Day 1 of this study")
- Subsumes("cerebrovascular accident", "CVA")
- Has_temporal("cerebrovascular accident", "within six months prior to Day 1 of this study")
- OR("primary brain tumor", "seizures", "brain metastases", "cerebrovascular accident")
- OR("CVA", "stroke")
- OR("cerebrovascular accident", "subarachnoid hemorrhage", "transient ischemic attack (TIA)")